Clinical trial exclusion criterion:
Inability to undergo MRI with gadolinium administration

Annotated entities:
- Condition: "Inability to undergo MRI"
- Procedure: "MRI"
- Drug: "gadolinium"
- Mood: "Inability to"